Pseudocholinesterase deficiency

The above is a clinical trial exclusion criterion. Annotated with entity spans:
[Condition: Pseudocholinesterase deficiency]